Clinical trial inclusion criteria:
Non-affective psychosis
Premorbid IQ of over 70
A service user of the early intervention service
Aged 18 or over (up to the age of 35 which is the limit for the early intervention service)
Psychiatrically stable enough to attend to completion (no hospitalisations or medication changes in last 4 weeks)

Annotated entities:
- Condition: "Non-affective psychosis"
- Measurement: "Premorbid IQ"
- Value: "over 70"
- Non-query-able: "A service user of the early intervention service"
- Value: "18 or over"
- Person: "Aged"
- Value: "up to the age of 35"
- Condition: "Psychiatrically stable"
- Procedure: "hospitalisations"
- Negation: "no"
- Observation: "medication changes"
- Temporal: "in last 4 weeks"